我國2014年國民醫療保健支出佔國內生產毛額之比率（NHE／GDP），下列何者比較接近？
A. 4.2%
B. 5.2%
C. 6.2%
D. 7.2%

正確答案：C. 6.2%